¿Qué caracteriza al proceso de envejecimiento fisiológico del sistema musculoesquelético?
1. Adelgazamiento sinovial.
2. Cifosis lumbar más pronunciada.
3. Rotura de las superficies articulares.
4. Acortamiento de los periodos de latencia y relajación musculares.
5. Disminución del tejido conectivo óseo.

Respuesta correcta: 5. Disminución del tejido conectivo óseo.